Unable to attend scheduled visits (eg, lack of transportation) or lack of a caregiver or guardian to supervise study participation

The above is a clinical trial exclusion criterion. Annotated with entity spans:
[Mood: Unable to attend scheduled visits] (eg, [Observation: lack of transportation]) or [Observation: lack of a caregiver] or guardian to supervise study participation